Clinical trial exclusion criterion:
Diagnosed or past history of ASCVD (including ACS, SCAD, revascularization, ICM, ischemic stroke, TIA, PASD, etc.

Entity relations:
- Subsumes("ASCVD", "ACS")
- OR("ACS", "TIA", "ischemic stroke", "ICM", "revascularization", "SCAD", "PASD")